下列有關透納氏症（Turner syndrome）之敘述，何者錯誤？
A. 身材矮小及蹼狀頸
B. 出生時手足出現淋巴性水腫
C. 染色體基因型 45,X 最常見
D. 常造成女性初經提早或第二性徵早熟

正確答案：D. 常造成女性初經提早或第二性徵早熟